Clinical trial inclusion criterion:
PTSD related to physical or sexual assault

Entity relations:
- Has_context("PTSD", "physical assault")
- OR("physical assault", "sexual assault")